Clinical trial inclusion criterion:
Alkaline phosphatase: ≤ 2.5 x ULN

Annotated entities:
- Measurement: "Alkaline phosphatase"
- Value: "≤ 2.5 x ULN"